Patients requiring long-acting opioid pain management (including fentanyl patch, oxycontin, etc) for over 3 weeks immediately prior to surgery

The above is a clinical trial exclusion criterion. Annotated with entity spans:
Patients [Mood: requiring] [Drug: long-acting opioid] pain management (including [Drug: fentanyl patch], [Drug: oxycontin], etc) [Multiplier: for over 3 weeks] [Temporal: immediately prior to surgery]